Clinical trial inclusion criterion:
Patients (or legal representative) willing and able to provide written Informed Consent Form.

Annotated entities:
- Informed_consent: "Patients (or legal representative) willing and able to provide written Informed Consent Form"